Clinical trial inclusion criterion:
11. Willing to answer acceptability and adherence questionnaires throughout the study

Annotated entities:
- Observation: "adherence questionnaires"
- Observation: "acceptability questionnaires"
- Temporal: "throughout the study"
- Mood: "Willing"
- Post-eligibility: "Willing to answer acceptability and adherence questionnaires throughout the study"
- Non-query-able: "Willing to answer acceptability and adherence questionnaires throughout the study"